Clinical trial exclusion criterion:
Breastfeeding;

Annotated entities:
- Observation: "Breastfeeding"